36歲男性，主訴近2年每年冬天都有持續2個月，在後眼窩劇烈疼痛，固定每晚發作，且時間約15分鐘到3小時不等，每次痛起來都會有單側流淚和眼睛紅的情形。此病人最可能的診斷是：
A. 偏頭痛（migraine）
B. 叢發性頭痛（cluster headache）
C. 緊張性頭痛（tension-type headache）
D. 三叉神經痛（trigeminal neuralgia）

正確答案：B. 叢發性頭痛（cluster headache）